有關膽汁及膽結石的敘述，下列何者錯誤？
A. 正常情況下肝臟每天分泌膽汁約 500 至 1,000 毫升
B. 膽結石發生率隨年齡增加而升高
C. 膽結石造成的疼痛主要是由結石磨擦膽囊壁所引起的
D. 一般而言，膽結石較好發於女性

正確答案：C. 膽結石造成的疼痛主要是由結石磨擦膽囊壁所引起的